Clinical trial exclusion criterion:
Severe cardiovascular diseases;

Entity relations:
- Has_qualifier("cardiovascular diseases", "Severe")